Clinical trial exclusion criterion:
Untreated phaeochromocytoma.

Annotated entities:
- Condition: "phaeochromocytoma"
- Qualifier: "Untreated"